Clinical trial exclusion criterion:
structural and functional urogenital abnormalities, that predispose for urogenital infections

Annotated entities:
- Condition: "urogenital abnormalities"
- Qualifier: "structural"
- Qualifier: "functional"
- Parsing_Error: "and"
- Observation: "predispose for urogenital infections"
- Condition: "urogenital infections"